一位 32 歲男子，因使用毒品過量被朋友送至急診，當時意識不清（drowsiness）、對刺激反應差、呼吸速度每分鐘不到 10 次、體溫攝氏 35.6 度、血壓 68/32 mmHg、心跳每分鐘 46 次，則此病人最可能是下列何種物質中毒？
A. 安非他命（amphetamine）
B. K 他命（ketamine）
C. 幻覺劑（LSD）
D. 類鴉片類（opioids）

正確答案：D. 類鴉片類（opioids）